Clinical trial inclusion criterion:
4. In the past one month, the clinical condition (including history, clinical symptoms and signs) was relatively stable;

Entity relations:
- Has_qualifier("history", "relatively stable")
- Has_temporal("history", "In the past one month")
- Has_qualifier("clinical symptoms", "relatively stable")
- Has_qualifier("clinical signs", "relatively stable")
- Has_temporal("clinical symptoms", "In the past one month")
- Has_temporal("clinical signs", "In the past one month")